¿Cuál de las siguientes alteraciones se encuentra dentro de las alteraciones de la conciencia corporal?
1. Estado crepuscular.
2. Estadio asténico-apático.
3. Disociación hipnótica.
4. Astereognosia.
5. Automatismo.

Respuesta correcta: 4. Astereognosia.